Recibe en la Unidad de Cuidados Intensivos Neonatales a un neonato de 12 días de vida derivado desde el Servicio de Urgencias Pediátricas, al que sus padres han acudido por rechazo de las tomas, estado letárgico, disminución de la frecuencia urinaria y coloración grisácea. A su ingreso, presenta insuficiencia respiratoria severa con signos congestivos, acidosis metabólica severa y ausencia de pulsos en miembro superior izquierdo y miembros inferiores. ¿Cuál es su sospecha clínica?:
1. Coartación aórtica severa en posición yuxtaductal habitual.
2. Interrupción del arco aórtico tipo A, con obstrucción distal al origen de la subclavia izquierda.
3. Interrupción del arco aórtico tipo B, con obstrucción entre la carótida izquierda y la subclavia izquierda.
4. Retorno venoso pulmonar anómalo total obstructivo.

Respuesta correcta: 3. Interrupción del arco aórtico tipo B, con obstrucción entre la carótida izquierda y la subclavia izquierda.